Clinical trial exclusion criterion:
Prior treatment with more than 2 cycles of carboplating-based chemotherapy regimens

Annotated entities:
- Qualifier: "carboplating-based"
- Value: "more than 2 cycles"
- Procedure: "treatment"
- Temporal: "Prior"
- Procedure: "chemotherapy regimens"